Clinical trial exclusion criterion:
Has current signs or symptoms of significant medical illness which could interfere with the trial, or require treatment that might interfere with the trial

Entity relations:
- Has_qualifier("medical illness", "significant")
- Has_mood("treatment", "require")
- Has_context("treatment", "interfere with the trial")
- Has_context("medical illness", "interfere with the trial")
- OR("interfere with the trial", "treatment")